with multiple sclerosis according to the criteria of Mac Donald 2010 : relapsing-remitting (RR), secondary-progressive (SP) or primary-progressive (PP)

The above is a clinical trial inclusion criterion. Annotated with entity spans:
with [Condition: multiple sclerosis] according to the [Measurement: criteria of Mac Donald 2010] : [Qualifier: relapsing-remitting] ([Qualifier: RR]), [Qualifier: secondary-progressive] ([Qualifier: SP]) or [Qualifier: primary-progressive] ([Qualifier: PP])